Clinical trial inclusion criterion:
Patient with a CHADS2VASC score =2

Entity relations:
- Has_value("CHADS2VASC score", "=2")